Es un compuesto fluorescente, su rendimiento cuántico de fluorescencia es:
1. Φ     Número de fotones emitidos/Número de fotones absorbidos.
2. Φ      Longitud de onda de excitación/Longitud de onda de emisión.
3. Φ Número de fotones absorbidos/Número de fotones emitidos.
4. Φ Longitud de onda de emisión/Longitud de onda de excitación.

Respuesta correcta: 1. Φ     Número de fotones emitidos/Número de fotones absorbidos.